有關胸腺瘤之敘述，下列何者錯誤？
A. 手術切除是主要的治療方法
B. 重症肌無力是最常伴隨的 paraneoplastic syndrome
C. 病理特徵屬於良性的病灶，因此臨床上不會有遠端轉移的現象
D. 完整的手術切除是影響術後預後的重要因素

正確答案：C. 病理特徵屬於良性的病灶，因此臨床上不會有遠端轉移的現象